Clinical trial inclusion criterion:
Diagnosis of comorbid DSM-IV major depressive episode will be allowed in the study provided that the diagnosis is secondary to OCD, they have a baseline Montgomery Depression Rating Scale (MADRS) score of less than or equal to 19, and the onset of OCD predates the onset of the current episode of depression by five or more years.

Entity relations:
- Has_qualifier("major depressive episode", "DSM-IV")
- AND("major depressive episode", "OCD")
- Has_qualifier("Montgomery Depression Rating Scale", "baseline")
- Subsumes("Montgomery Depression Rating Scale", "MADRS")
- Has_value("Montgomery Depression Rating Scale", "score of less than or equal to 19")
- Has_index("predates the onset of the current episode of depression by five or more years", "onset of the current episode of depression")
- Has_qualifier("major depressive episode", "comorbid")